Clinical trial exclusion criterion:
Advanced or distant metastatic stage,

Annotated entities:
- Value: "distant metastatic"
- Measurement: "stage"
- Value: "Advanced metastatic"